Patients with myasthenia gravis or systemic lupus erythematosus

The above is a clinical trial exclusion criterion. Annotated with entity spans:
Patients with [Condition: myasthenia gravis] or [Condition: systemic lupus erythematosus]